Clinical trial exclusion criterion:
Patients requiring surgery for neoplastic processes

Entity relations:
- AND("surgery", "neoplastic processes")